Patients undergoing tibial tubercle osteotomy (TTO) with or without medial patello-femoral ligament (MPFL) reconstruction

The above is a clinical trial inclusion criterion. Annotated with entity spans:
Patients [Temporal: undergoing] [Procedure: tibial tubercle osteotomy (TTO)] with or without [Procedure: medial patello-femoral ligament (MPFL) reconstruction]